Clinical trial exclusion criterion:
4. Previously participated in any HIV vaccine study

Annotated entities:
- Context_Error: "Previously participated in any HIV vaccine study"